Un patrón general de déficit sociales e interpersonales asociados a malestar agudo y una capacidad reducida para las relaciones personales, así como distorsiones cognoscitivas o perceptivas y excentricidades del comportamiento, que comienzan al principio de la edad adulta, hace referencia a un trastorno de la personalidad:
1. Esquizoide.
2. Esquizotípico.
3. Antisocial.
4. Límite.
5. Paranoide.

Respuesta correcta: 2. Esquizotípico.